Age less than one year or age greater than/equals to 18 years

The above is a clinical trial exclusion criterion. Annotated with entity spans:
[Person: Age] [Value: less than one year] or [Person: age] [Value: greater than/equals to 18 years]